下列那一個激素無法促進脂肪細胞（adipocyte）內脂肪的代謝以產生 ATP？
A. Insulin
B. Glucagon
C. Epinephrine
D. Glucocorticoids

正確答案：A. Insulin